Clinical trial inclusion criterion:
Male or female, 18 years of age or older.

Annotated entities:
- Person: "Male"
- Person: "female"
- Value: "18 years or older"
- Person: "age"